Clinical trial exclusion criterion:
Unable to commit to intervention for duration of protocol

Annotated entities:
- Post-eligibility: "Unable to commit to intervention for duration of protocol"